金黃色葡萄球菌（Staphylococcus aureus）是根據其菌體的那種成分被區分成11種血清型（serotypes）？
A. 胜肽聚醣（peptidoglycan）
B. 蛋白質A（Protein A）
C. 脫皮毒素（Exfoliative toxins）
D. 莢膜多醣體（capsular polysaccharide）

正確答案：D. 莢膜多醣體（capsular polysaccharide）